El entrenamiento sistemático para la redirección de la atención a aspectos o estímulos externos positivos para contrarrestar el exceso de autoconciencia, forma parte de los protocolos de tratamiento psicológico especialmente para:
1. El trastorno obsesivo-compulsivo.
2. La agorafobia.
3. El trastorno de angustia (trastorno de pánico).
4. La fobia social.
5. El trastorno del estrés postraumático.

Respuesta correcta: 4. La fobia social.